2. Screening tools: TMS adult safety screening.

The above is a clinical trial exclusion criterion. Annotated with entity spans:
[Parsing_Error: 2.] [Procedure: Screening] tools: [Procedure: TMS adult safety screening].